Clinical trial inclusion criterion:
Male or Female

Annotated entities:
- Person: "Male"
- Person: "Female"